Clinical trial exclusion criteria:
Optune compliance < 75%; they would be excluded from the final analyses.
History of craniectomy or significant skull defect (contraindication to Optune).
Active implantable medical device (i.e. DBS, spinal cord stimulator, pacemaker, defibrillator, vagus nerve stimulator, programmable shunt).
Karnofsky Performance Status (KPS) < 60.

Annotated entities:
- Observation: "Optune compliance"
- Multiplier: "< 75%"
- Non-query-able: "they would be excluded from the final analyses"
- Procedure: "craniectomy"
- Condition: "skull defect"
- Qualifier: "significant"
- Device: "Optune"
- Condition: "contraindication"
- Device: "implantable medical device"
- Device: "DBS"
- Device: "spinal cord stimulator"
- Device: "pacemaker"
- Device: "defibrillator"
- Device: "vagus nerve stimulator"
- Device: "programmable shunt"
- Qualifier: "Active"
- Measurement: "Karnofsky Performance Status"
- Measurement: "KPS"
- Value: "< 60"